Pedro con historia de estreñimiento crónico, presenta impactación fecal con fecalomas. De las siguientes afirmaciones sobre las actividades a realizar para la extracción digital de los mismos. ¿Cuál NO es correcta?:
1. No utilizar laxantes ni enemas.
2. Explicar a la persona lo que se le va a hacer y vigilar los signos vitales.
3. Extraer la masa fecal con cuidado y sin romperla, para favorecer la estimulación rectal y la defecación.
4. Colocar al paciente en decúbito lateral izquierdo.

Respuesta correcta: 3. Extraer la masa fecal con cuidado y sin romperla, para favorecer la estimulación rectal y la defecación.